利用何種集中趨勢的參數，可以用來計算標準差？
A. 幾何平均數
B. 眾數
C. 中位數
D. 算術平均數

正確答案：D. 算術平均數